Clinical trial exclusion criterion:
Surgery involving the eye, eyebrow, forehead, or frontal scalp near the sensor placement

Entity relations:
- Has_qualifier("Surgery", "eye")
- OR("eye", "frontal scalp", "eyebrow", "forehead")